有關癌症轉移到骨骼（carcinoma metastasis to bone）的敘述，下列何者最正確？
A. 癌症轉移性骨病灶常見於肢體遠端如手或腳處
B. 造成病理性骨折後，截肢（amputation）手術可增加病患存活率
C. 轉移是經由血行性（hematogenous route）來到骨骼處形成病灶
D. 骨質本身遭破壞達 10%時 X 光攝影可發現異常

正確答案：C. 轉移是經由血行性（hematogenous route）來到骨骼處形成病灶